Clinical trial exclusion criterion:
12. Any serious acute, chronic or progressive disease

Annotated entities:
- Condition: "disease"
- Qualifier: "progressive"
- Multiplier: "chronic"
- Temporal: "acute"
- Qualifier: "serious"
- Subjective_judgement: "Any serious acute, chronic or progressive disease"
- Post-eligibility: "Any serious acute, chronic or progressive disease"